Treprostinil contraindications: Known hypersensitivity to treprostinil or any of the excipients, Pulmonary arterial hypertension related to veno-occlusive disease, Congestive heart failure due to severe left ventricular dysfunction, Severe hepatic insufficiency (Child-Pugh stage C), Evolving gastrointestinal ulcer, intracranial hemorrhage, recent trauma or other clinical condition that may lead to bleeding, Congenital or acquired valvular abnormalities with cardiac repercussions, Severe ischemic heart disease or unstable angina; Myocardial infarction in the last six months; Decompensated cardiac insufficiency not medically controlled; Severe arrhythmias; Cerebrovascular lesions (such as transient ischemic attack, stroke) that occurred within the last three months.

The above is a clinical trial exclusion criterion. Annotated with entity spans:
[Drug: Treprostinil] [Condition: contraindications]: Known [Condition: hypersensitivity] to [Drug: treprostinil] or [Drug: any of the excipients], [Condition: Pulmonary arterial hypertension] related to [Condition: veno-occlusive disease], [Condition: Congestive heart failure] due to [Qualifier: severe] [Condition: left ventricular dysfunction], [Qualifier: Severe] [Condition: hepatic insufficiency] ([Measurement: Child-Pugh] [Value: stage C]), Evolving [Condition: gastrointestinal ulcer], [Condition: intracranial hemorrhage], [Temporal: recent] [Condition: trauma] or other [Condition: clinical condition that may lead to bleeding], [Condition: Congenital] or [Condition: acquired valvular abnormalities] [Qualifier: with cardiac repercussions], [Qualifier: Severe] [Condition: ischemic heart disease] or [Condition: unstable angina]; [Condition: Myocardial infarction] [Temporal: in the last six months]; [Condition: Decompensated cardiac insufficiency] not medically controlled; [Qualifier: Severe] [Condition: arrhythmias]; [Condition: Cerebrovascular lesions] (such as [Condition: transient ischemic attack], [Condition: stroke]) that occurred [Temporal: within the last three months].